Clinical trial exclusion criterion:
Major surgical procedure, open biopsy, or significant traumatic injury within 4 weeks prior to Day 1, or anticipation of need for major surgical procedure during the course of the study

Entity relations:
- Has_qualifier("traumatic injury", "significant")
- Has_qualifier("surgical procedure", "Major")
- Has_temporal("surgical procedure", "within 4 weeks prior to Day 1")
- Has_qualifier("surgical procedure", "major")
- Has_mood("surgical procedure", "anticipation of need")
- Has_temporal("surgical procedure", "during the course of the study")
- Has_index("within 4 weeks prior to Day 1", "Day 1")
- Has_index("during the course of the study", "the study")
- OR("within 4 weeks prior to Day 1", "Day 1")
- OR("surgical procedure", "open biopsy", "traumatic injury")
- OR("during the course of the study", "the study")
- OR("surgical procedure", "surgical procedure")